any skin breakdown (pressure sores)

The above is a clinical trial exclusion criterion. Annotated with entity spans:
any [Condition: skin breakdown] ([Condition: pressure sores])